Clinical trial exclusion criterion:
Traumatic Brain Injury (TBI) with a clear impact on activities of daily living

Annotated entities:
- Condition: "Traumatic Brain Injury (TBI)"
- Condition: "impact on activities of daily living"